Which receptor does GDF15 bind?

GDF15 binds specifically to GDNF family receptor α-like (GFRAL)